Clinical trial exclusion criterion:
not a regular user of e-cigarettes

Entity relations:
- AND("regular user", "e-cigarettes")
- Has_negation("regular user", "not")